Clinical trial exclusion criterion:
administration of anti-thymocyte globulin,

Annotated entities:
- Drug: "anti-thymocyte globulin"